¿Qué recomendaciones de autocuidado al alta le daría a un paciente con epistaxis?
1. Estornudar con la boca cerrada.
2. Realizar respiraciones profundas e instilarse solución salina en fosas nasales.
3. Sonarse la nariz con fuerza.
4. Evitar actividades que impliquen esfuerzo físico.
5. Adoptar la posición Fowler.

Respuesta correcta: 4. Evitar actividades que impliquen esfuerzo físico.